Clinical trial inclusion criterion:
Spinal Cord injury at or above L5

Entity relations:
- Has_qualifier("Spinal Cord injury", "at or above L5")